Clinical trial exclusion criterion:
Known to be severely alpha-1-antitrypsin deficient (PI SZ or ZZ)

Entity relations:
- Has_qualifier("alpha-1-antitrypsin deficient", "severely")